Señale la respuesta correcta respecto al dolor en la infancia:
1. La “escala de caras” se puede utilizar a partir de los tres años.
2. Los recién nacidos prematuros nacidos entre las semanas 28 y 38 de gestación son incapaces de sentir dolor.
3. El ácido acetilsalicílico es el tratamiento farmacológico de elección para tratar el dolor en menores de 1 año.
4. La “escala de NIPS” se utiliza para medir el dolor en los adolescentes.
5. Antes de los 5 años no se recomienda ninguna escala para valorar el dolor.

Respuesta correcta: 1. La “escala de caras” se puede utilizar a partir de los tres años.